Patients with severe cognitive impairment.

The above is a clinical trial exclusion criterion. Annotated with entity spans:
Patients with [Qualifier: severe] [Condition: cognitive impairment].